Clinical trial exclusion criterion:
Patient with hypersensitivity/allergy to either morphine, NSAIDs, or acetaminophen

Annotated entities:
- Condition: "hypersensitivity"
- Condition: "allergy"
- Drug: "morphine"
- Drug: "NSAIDs"
- Drug: "acetaminophen"